下列何者不屬縱隔（mediastinum）構造？
A. 食道
B. 胸腺
C. 肺臟
D. 胸主動脈

正確答案：C. 肺臟